有關腹直肌（rectus abdominis）的敘述，下列何者錯誤？
A. 此肌向上附	在肋軟骨及胸骨，向下附	在恥骨
B. 白線（linea alba）為左右腹直肌間的構造
C. 支配此肌的腹壁下動脈（inferior epigastric artery）起自髂內動脈（internal iliac artery）
D. 胸內動脈（internal thoracic artery）的末稍進入其鞘膜內成為腹壁上動脈（superior epigastric artery）

正確答案：C. 支配此肌的腹壁下動脈（inferior epigastric artery）起自髂內動脈（internal iliac artery）